Clinical trial exclusion criterion:
serious complications such as uncontrolled diabetes, gastric ulcer or other serious angiocardiopathy determined by the physician

Entity relations:
- Has_qualifier("complications", "serious")
- Has_qualifier("angiocardiopathy", "serious")
- Has_qualifier("diabetes", "uncontrolled")
- Subsumes("complications", "diabetes")
- OR("diabetes", "gastric ulcer", "angiocardiopathy")